7. History of any cerebrovascular accident;

The above is a clinical trial exclusion criterion. Annotated with entity spans:
7. [Temporal: History of] [Condition: any cerebrovascular accident];